Clinical trial exclusion criterion:
Subjects were not to have any history or presence or family history of schizophrenia, other psychotic illness, severe personality disorder, depression, or other significant psychiatric disorder.

Entity relations:
- Has_qualifier("psychiatric disorder", "significant")
- Has_temporal("schizophrenia", "history")
- OR("history", "presence", "family history")